Clinical trial inclusion criterion:
Must have a life expectancy of greater than three (3) months

Entity relations:
- Has_value("life expectancy", "greater than three (3) months")